關於肛門上皮樣細胞癌（anal epidermoid carcinoma）的敘述，下列何者錯誤？
A. 其細胞種類不同於直腸癌（rectal cancer）
B. 放射線治療合併化學治療（chemoradiation）是主要治療
C. 腹部會陰聯合切除術（abdominoperineal resection）是轉移性病況（metastatic disease）時的治療首選
D. 鼠蹊部淋巴腺是可能的轉移位置，且發生此處轉移時，通常患者的預後較為不好

正確答案：C. 腹部會陰聯合切除術（abdominoperineal resection）是轉移性病況（metastatic disease）時的治療首選